一旦血糖降低，下列何者可以將血糖恢復至正常數值？
A. 胰島素（insulin）增加，昇糖素（glucagon）降低
B. 胰島素降低，昇糖素增加
C. 胰島素增加，昇糖素增加
D. 胰島素降低，昇糖素降低

正確答案：B. 胰島素降低，昇糖素增加